Clinical trial inclusion criterion:
receiving venovenous or venoarterial ECMO

Annotated entities:
- Procedure: "venoarterial ECMO"
- Procedure: "venovenous ECMO"